21歲王小姐，主訴在運動時會有哮鳴及呼吸急促之現象。要預防在此情況下誘發氣喘，下列那一藥物是最佳 選擇？
A. 短效吸入型乙二型擬交感神經劑（β2-agonist）
B. 口服aminophylline
C. 吸入型抗膽鹼劑（anticholinergics）
D. 吸入型sodium cromoglycate（cromolyn）

正確答案：A. 短效吸入型乙二型擬交感神經劑（β2-agonist）